一位 56 歲的家庭主婦，育有兩男一女，無流產病史。40 歲時因為子宮肌瘤導致經血過多引起貧血症狀，與婦產科醫師討論過後，開刀將子宮切除，但保留兩側卵巢。52 歲左右時開始有臉潮紅、心悸、失眠等症狀，診斷為停經後症候群，曾使用女性荷爾蒙治療兩年。阿姨因乳癌於前年過世，因為聽說乳癌有家族遺傳性，擔心自己是否也會罹患乳癌，所以來到門診接受評估。此個案罹患乳癌最重要的危險因子為何？
A. 年齡超過 50 歲
B. 荷爾蒙治療
C. 阿姨得乳癌
D. 子宮切除術後

正確答案：A. 年齡超過 50 歲